下列關於抗體的敘述，何者錯誤？
A. 抗體IgG由兩個light chain（L）與兩個heavy chain（H）組成
B. 抗體IgG有兩個抗原結合位
C. 抗體N端的hypervariable loop region可與抗原專一性結合
D. light chain與heavy chain結構以α-helix為主

正確答案：D. light chain與heavy chain結構以α-helix為主